關於排卵前LH surge的生理效應之敘述，下列何者錯誤？
A. 可以恢復卵子第一次減數分裂（meiosis I）的進行
B. 促進濾泡中顆粒細胞（granulose cells）的黃體化（luteinization）
C. 促進濾泡中顆粒細胞（granulose cells）製造及分泌前列腺素（prostaglandins）
D. 促進濾泡中顆粒細胞（granulose cells）製造及分泌雄性素（androgens）

正確答案：D. 促進濾泡中顆粒細胞（granulose cells）製造及分泌雄性素（androgens）